Women with systemic lupus erythematosus (SLE)

The above is a clinical trial exclusion criterion. Annotated with entity spans:
[Person: Women] with [Condition: systemic lupus erythematosus (SLE)]